下列何者不是主動脈的直接分支？
A. 食道動脈（esophageal artery）
B. 後肋間動脈（posterior intercostal artery）
C. 支氣管動脈（bronchial artery）
D. 內胸動脈（internal thoracic artery）

正確答案：D. 內胸動脈（internal thoracic artery）